cycle length 25-34 days

The above is a clinical trial inclusion criterion. Annotated with entity spans:
[Measurement: cycle length] [Value: 25-34 days]